Clinical trial exclusion criterion:
An oral temperature >100.4° or acute disease within 72 hours prior to vaccination, defined as the presence of a moderate or severe illness (as determined by the investigator through medical history and physical examination; for example, those requiring an absence from work) with or without fever.

Annotated entities:
- Measurement: "oral temperature"
- Value: ">100.4°"
- Condition: "acute disease"
- Temporal: "within 72 hours prior to vaccination"
- Reference_point: "vaccination"
- Condition: "moderate illness"
- Condition: "severe illness"